36歲有抽菸男性，因胸痛來到急診，胸痛已有八個小時，會傳向雙側上臂，且胸痛會因吸氣而加重，躺下時更嚴重，在坐起時上半身略向前傾會好一些。身體診察血壓140/72毫米汞柱，心跳每分鐘96次，沒用氧氣時 血氧飽和度百分之九十八。肺部聽診沒有異常，只在左下胸骨邊緣聽到具三個成份的摩擦聲（three component friction rub）。此時進行心電圖檢查最可能看到：
A. 胸前導程反向T波（inverted T wave）
B. PR節段在第二、第三和aVF導程上升
C. 胸前導程（V1 - V6），ST段凸形彎曲（convex curvature）上升
D. 胸前導程（V2 - V6）與第一導程，aVL導程，ST段凹形彎曲（concave curvature）上升

正確答案：D. 胸前導程（V2 - V6）與第一導程，aVL導程，ST段凹形彎曲（concave curvature）上升